¿Qué programas de reforzamiento simple producen un patrón de repuesta más estable?:
1. Los de razón fija.
2. Los de razón variable.
3. Los de intervalo fijo.
4. Los de intervalo variable.
5. Todos los programas de reforzamiento producen tasas similares de respuesta.

Respuesta correcta: 2. Los de razón variable.